Clinical trial inclusion criterion:
Fertile men and women of childbearing potential must agree to use an effective method of birth control from providing signed consent and for 120 days after last study drug administration. Women of childbearing potential include pre-menopausal women and women within the first 2 years of the onset of menopause. Women of childbearing potential must have a negative pregnancy test ≤ 72 hours prior to Day 1 of study.

Entity relations:
- Has_index("from providing signed consent", "providing signed consent")
- Has_index("for 120 days after last study drug administration", "last study drug administration")
- Has_temporal("birth control", "from providing signed consent")
- Has_temporal("birth control", "for 120 days after last study drug administration")
- AND("men", "birth control")
- Has_index("within the first 2 years of the onset of menopause", "the onset of menopause")
- Has_value("pregnancy test", "negative")
- Has_index("≤ 72 hours prior to Day 1", "Day 1")
- Has_temporal("pregnancy test", "≤ 72 hours prior to Day 1")
- AND("childbearing potential", "pregnancy test")
- AND("childbearing potential", "birth control")
- AND("Women", "pregnancy test")
- OR("men", "women")